Age between 2 to <17 years at Visit 2.

The above is a clinical trial inclusion criterion. Annotated with entity spans:
[Person: Age] [Value: between 2 to <17 years] [Temporal: at Visit 2].